Clinical trial inclusion criterion:
Serum creatinine =1.5 mg/dl or eGFR=60(ml/min/1.73 m2)

Annotated entities:
- Measurement: "Serum creatinine"
- Value: "=1.5 mg/dl"
- Measurement: "eGFR"
- Value: "=60(ml/min/1.73 m2)"